Clinical trial inclusion criterion:
20 - 65 years old

Entity relations:
- Has_value("old", "20 - 65 years")